Clinical trial exclusion criterion:
Pregnant or lactating women.

Entity relations:
- OR("Pregnant", "lactating")